Clinical trial exclusion criterion:
Younger than 18 years of age

Annotated entities:
- Value: "Younger than 18 years"
- Person: "age"